下列關於精神分裂症（schizophrenic disorder）流行病學的描述，何者錯誤？
A. 台灣的流行病學顯示其盛行率約為千分之三左右
B. 發病年齡多在 15 到 45 歲
C. 男女比例約為 2：1
D. 與季節有關的危險因子，如病毒感染，有可能會致使精神分裂症發病

正確答案：C. 男女比例約為 2：1